Simultaneous participation in another interventional clinical trial (drugs or medical devices studies)

The above is a clinical trial inclusion criterion. Annotated with entity spans:
[Competing_trial: Simultaneous participation in another interventional clinical trial (drugs or medical devices studies)]